Clinical trial exclusion criterion:
2. Patients in the acute phase of severe hepatitis

Annotated entities:
- Condition: "severe hepatitis"
- Qualifier: "acute phase"